物理醫學上，下列何者不是冷療（cryotherapy）的生理作用？
A. 可減低疼痛
B. 可促使血管收縮
C. 可減緩肌肉收縮速度
D. 可增加韌帶強度

正確答案：D. 可增加韌帶強度